當人體的呼吸道暴露在過敏原時，產生早期支氣管攣縮反應（early bronchospastic response），會導致氣喘病的急性發作，其主要原因為：
A. 化學激素（chemokines）分泌引致嗜伊紅性白血球的趨化作用（chemotaxis）
B. 第一型輔助細胞（TH1-lymphocytes）產生介白質-2（interleukin-2）及丙型干擾素（interferon-gamma）
C. 肥胖細胞（mast cells）分泌組織胺（histamine）及白三烯素（leukotrienes）
D. 呼吸道杯狀細胞增生（goblet cell hyperplasia）及黏液積滯（mucus plug）

正確答案：C. 肥胖細胞（mast cells）分泌組織胺（histamine）及白三烯素（leukotrienes）